Clinical trial exclusion criterion:
Known allergies to aspirin, ticagrelor or cangrelor

Annotated entities:
- Condition: "allergies"
- Drug: "aspirin"
- Drug: "ticagrelor"
- Drug: "cangrelor"